Clinical trial exclusion criterion:
Very excessive daytime sleepiness (Epworth Sleepiness Scale> 18).

Entity relations:
- Has_value("Epworth Sleepiness Scale", "> 18")
- Has_qualifier("daytime sleepiness", "Very excessive")
- Subsumes("daytime sleepiness", "Epworth Sleepiness Scale")